Stable medical history and general health

The above is a clinical trial inclusion criterion. Annotated with entity spans:
[Temporal: Stable medical history] and general health